腎上腺髓質（adrenal medulla）的細胞，因接受下列那一神經的刺激而釋放腎上腺素？
A. postganglionic sympathetic neuron
B. postganglionic parasympathetic neuron
C. preganglionic sympathetic neuron
D. preganglionic parasympathetic neuron

正確答案：C. preganglionic sympathetic neuron